Clinical trial exclusion criterion:
Clinically significant abnormal 12-lead ECG findings;

Annotated entities:
- Qualifier: "Clinically significant"
- Qualifier: "abnormal"
- Procedure: "12-lead ECG"
- Condition: "findings"